Clinical trial inclusion criterion:
1. Male and female subjects must be 18 years of age or older and ambulatory.

Entity relations:
- Has_value("age", "18 years or older")
- OR("Male", "female")